Clinical trial exclusion criterion:
Long life major depression. Baseline scores =16 on the 17-item Hamilton Depression Scale at baseline.

Annotated entities:
- Condition: "Long life major depression"
- Measurement: "Baseline scores"
- Value: "=16"
- Measurement: "17-item Hamilton Depression Scale"
- Temporal: "at baseline"
- Reference_point: "baseline"